La Sra X es una paciente de 76 años de edad que en los últimos tiempos ha sufrido diversas caídas con fracturas en ambos brazos. El diagnóstico por imagen denota la evidencia de osteoporosis y el traumatólogo decide iniciar un tratamiento con teriparatida. Debemos considerar que:
1. La teriparatida es un análogo de la vitamina D.
2. Se administra en una dosis diaria por vía subcutánea.
3. Se administra únicamente por vía endovenosa.
4. Actúa como agonista del receptor a la vitamina D3.
5. No favorece el aumento de masa ósea.

Respuesta correcta: 2. Se administra en una dosis diaria por vía subcutánea.